Known allergic reactions to tenecteplase, clopidogrel, enoxaparin and aspirin

The above is a clinical trial exclusion criterion. Annotated with entity spans:
Known [Condition: allergic reactions] to [Drug: tenecteplase], [Drug: clopidogrel], [Drug: enoxaparin] and [Drug: aspirin]